Clinical trial exclusion criterion:
Complications to RYGB. Documented reactive hypoglycaemia, severe dumping (vomiting, diarrhea, severe abdominal pain after food intake).

Entity relations:
- AND("Complications", "RYGB")
- Has_qualifier("dumping", "severe")
- Has_qualifier("abdominal pain", "severe")
- Has_index("after food intake", "food intake")
- Has_temporal("abdominal pain", "after food intake")
- Subsumes("dumping", "vomiting")
- Subsumes("Complications", "reactive hypoglycaemia")
- OR("vomiting", "diarrhea", "abdominal pain")